Chronic use of any medication, except homeopathy, and trivial ones, as nasal physiologic solution and vitamins;

The above is a clinical trial exclusion criterion. Annotated with entity spans:
[Multiplier: Chronic use] of [Drug: any medication], [Negation: except] [Procedure: homeopathy], and [Drug: trivial ones], as [Drug: nasal physiologic solution] [Grammar_Error: and] [Drug: vitamins];